Women of childbearing potential must have a negative serum pregnancy test within 14 days prior to initiation of treatment and must not be lactating.

The above is a clinical trial inclusion criterion. Annotated with entity spans:
[Person: Women] of [Condition: childbearing potential] must have a [Value: negative] [Measurement: serum pregnancy test] [Temporal: within 14 days prior to initiation of treatment] and must [Negation: not] be [Condition: lactating].